En la valoración del anión cloruro con el ión plata, mediante el método Mohr, la especie que se utiliza como indicador del punto final es:
1. Fluoresceína.
2. Cromato potásico.
3. Tiocianato potásico +Hierro trivalente.
4. Azul de bromofenol.

Respuesta correcta: 2. Cromato potásico.